足月分娩時，下列何者不是發生胎兒窘迫的情形？
A. 胎心出現"晚期減速＂
B. 臍動脈血流速度波形出現逆流
C. 胎心出現"早期減速＂
D. 臍動脈血流速度波形呈現舒張期無血流

正確答案：C. 胎心出現"早期減速＂